下列那一種經濟分析方法，會將政策實施結果以自然單位（例如避免死亡人數或醫療服務人次）來計算，而且比較適合用在有 2 個或以上政策替選方案的情況下，回答那一個政策或方案「最有效率」的問題？
A. 成本效益分析（cost-benefit analysis）
B. 成本效果分析（cost-effectiveness analysis）
C. 成本效用分析（cost-utility analysis）
D. 成本分析（cost analysis）

正確答案：B. 成本效果分析（cost-effectiveness analysis）